Clinical trial inclusion criterion:
3. Signed the informed consent

Annotated entities:
- Informed_consent: "Signed the informed consent"